Clinical trial inclusion criterion:
Outpatient with primary DSM- IV OCD

Annotated entities:
- Condition: "OCD"
- Qualifier: "primary"
- Qualifier: "DSM- IV"
- Visit: "Outpatient"